Clinical trial exclusion criterion:
Clinically superinfected digital ulcers

Annotated entities:
- Condition: "digital ulcers"
- Observation: "superinfected"